一位35歲男性患者因持續右側腹痛就醫，經下消化道攝影發現升結腸有一蘋果核（apple core）般的病灶，下列何者是不需要的檢查？
A. 大腸鏡切片檢查（colonoscopic biopsy）
B. 電腦斷層（CT scan）
C. 癌胚胎抗原（CEA）
D. 甲型胎兒蛋白（AFP）

正確答案：D. 甲型胎兒蛋白（AFP）